Inhaled Molgramostim can be used for treatment of which disease?

Inhaled Molgramostim was shown to be effective for Autoimmune Pulmonary Alveolar Proteinosis.